Clinical trial inclusion criterion:
Planned operation of laparoscopic Roux-en Y gastric bypass (LRYGB) or laparoscopic sleeve gastrectomy (LSG) as primary bariatric procedure

Entity relations:
- Has_qualifier("laparoscopic Roux-en Y gastric bypass (LRYGB)", "primary")
- OR("laparoscopic Roux-en Y gastric bypass (LRYGB)", "laparoscopic sleeve gastrectomy (LSG)")